Clinical trial inclusion criterion:
Any anti-diabetic agent except SGLT2 inhibitors, TZDs(thiazolidinediones), DPP4(Dipeptidyl peptidase4) inhibitors and GLP1 RAs(Glucagon-like Peptide 1-Receptor Agonists)

Annotated entities:
- Drug: "anti-diabetic agent"
- Negation: "except"
- Drug: "SGLT2 inhibitors"
- Drug: "TZDs"
- Drug: "thiazolidinediones"
- Drug: "DPP4 inhibitors"
- Drug: "Dipeptidyl peptidase4 inhibitors"
- Drug: "GLP1 RAs"
- Drug: "Glucagon-like Peptide 1-Receptor Agonists"